Metal containing corpora aliena in the eye or brain.

The above is a clinical trial exclusion criterion. Annotated with entity spans:
[Qualifier: Metal containing] [Device: corpora aliena in the eye] or brain.